Clinical trial inclusion criterion:
Male and females aged between 18 and 65 years of age inclusive, at the time of signing the informed consent.

Entity relations:
- Has_value("aged", "between 18 and 65 years")
- Has_value("age", "between 18 and 65 years")
- Has_index("at the time of signing the informed consent", "signing the informed consent")
- Has_temporal("between 18 and 65 years", "at the time of signing the informed consent")
- OR("Male", "females")
- OR("aged", "age")